Clinical trial exclusion criterion:
History of other chronic neurological illnesses that might mimic MS with chronic or intermittent symptoms (i.e. ALS, myasthenia gravis, chronic neuropathy, etc.)

Entity relations:
- Has_qualifier("chronic neurological illnesses", "mimic MS")
- Subsumes("chronic neurological illnesses", "ALS")
- Has_temporal("chronic neurological illnesses", "History of")
- OR("ALS", "myasthenia gravis", "chronic neuropathy")